Clinical trial exclusion criterion:
current psychosis

Annotated entities:
- Condition: "psychosis"
- Temporal: "current"